Clinical trial exclusion criteria:
patients with cancer
patients with chronic inflammation diseases

Annotated entities:
- Condition: "cancer"
- Condition: "chronic inflammation diseases"